What is the mode of administration of AZD8601?

AZD8601 is administered intradermally.